Which cytokine molecule activates SMADs?

TGF-β1 effects appear to be mediated through the canonical Smad pathway.